Cancer and Leukemia Group B (CALGB) performance status less than or equal to 2

The above is a clinical trial inclusion criterion. Annotated with entity spans:
[Measurement: Cancer and Leukemia Group B (CALGB) performance status] [Value: less than or equal to 2]